Una disolución diluida ideal se caracteriza por:
1. Todos los componentes cumplen la ley de Raoult.
2. Únicamente el soluto cumple la ley de Raoult.
3. El disolvente cumple la ley de Henry.
4. Todos los componentes cumplen la ley de Henry.
5. Únicamente el soluto cumple la ley de Henry.

Respuesta correcta: 1. Todos los componentes cumplen la ley de Raoult.